Clinical trial inclusion criterion:
Women seeking medication abortion through 70 days gestation

Annotated entities:
- Person: "Women"
- Procedure: "medication abortion"
- Temporal: "through 70 days gestation"